Clinical trial inclusion criteria:
medical indication for induction of labor
18 years of age
signed informed consent
cephalic presentation
no PROM
37+0 - 42+0 weeks of gestation
Bishop-Score = 6
no contra-indication for medical induction of labor
no clinical signs of infection

Annotated entities:
- Condition: "medical indication"
- Procedure: "induction of labor"
- Value: "18 years"
- Person: "age"
- Informed_consent: "signed informed consent"
- Condition: "cephalic presentation"
- Condition: "PROM"
- Negation: "no"
- Value: "37+0"
- Value: "42+0"
- Measurement: "weeks of gestation"
- Measurement: "Bishop-Score"
- Value: "= 6"
- Condition: "contra-indication"
- Negation: "no"
- Procedure: "medical induction of labor"
- Negation: "no"
- Mood: "clinical signs of"
- Condition: "infection"